Provide signed and dated informed consent form.

The above is a clinical trial inclusion criterion. Annotated with entity spans:
[Non-query-able: Provide signed and dated informed consent form.]